一位 52 歲男性，主訴近 2 個月來逐漸吞嚥困難，經上消化道內視鏡檢查發現，在其距門齒下 23 公分處有一腫瘤阻塞了整個食道管徑。經病理切片診斷，證實為食道鱗狀上皮細胞癌。此腫瘤最可能往外侵犯至那一器官？
A. 氣管
B. 橫膈膜
C. 心包膜
D. 肺靜脈

正確答案：A. 氣管